Uncontrolled systemic hypertension;

The above is a clinical trial exclusion criterion. Annotated with entity spans:
[Qualifier: Uncontrolled] [Condition: systemic hypertension];